Clinical trial exclusion criterion:
Participation in another clinical trial during the present clinical trial or within the last three months

Annotated entities:
- Competing_trial: "Participation in another clinical trial during the present clinical trial or within the last three months"